Genetic and metabolic diseases.

The above is a clinical trial exclusion criterion. Annotated with entity spans:
[Condition: Genetic] and [Condition: metabolic diseases].